下列那一個分子不是糖解作用（glycolysis）與糖質新生（gluconeogenesis）共同的中間產物？
A. 磷酸烯醇式丙酮酸（phosphoenolpyruvate）
B. 草醯乙酸（oxaloacetate）
C. 1,3-二磷酸甘油酸（1,3-bisphosphoglycerate）
D. 6-磷酸葡萄糖（glucose 6-phosphate）

正確答案：B. 草醯乙酸（oxaloacetate）